H. pylori infection

The above is a clinical trial exclusion criterion. Annotated with entity spans:
[Condition: H. pylori infection]